Clinical trial inclusion criterion:
Fasting TG<500mg/dL

Entity relations:
- Has_value("Fasting TG", "<500mg/dL")